Clinical trial exclusion criterion:
Liver disease (cirrhosis or liver failure)

Entity relations:
- Subsumes("Liver disease", "cirrhosis")
- OR("cirrhosis", "liver failure")